What type of topoisomerase inhibitor is gepotidacin?

Gepotidacin is a type IIA topoisomerase inhibitor.